針對乳房的Mondor's disease最佳的處置為何？
A. 手術切除
B. 放射線治療
C. 荷爾蒙治療
D. 支持性治療

正確答案：D. 支持性治療